下列何者是甲狀腺髓質癌（medullary thyroid cancer）的細胞來源？
A. 濾泡細胞（follicular epithelial cells）
B. 濾泡旁細胞（calcitonin producing cells, C cells）
C. 淋巴球細胞（lymphocytes）
D. 纖維母細胞（fibroblasts）

正確答案：B. 濾泡旁細胞（calcitonin producing cells, C cells）